Mujer de 70 años con antecedentes de hipertensión e insuficiencia cardiaca moderada que acude a la consulta por presentar tos persistente y seca que se inicia como una sensación de picor en la garganta. En la analítica se observa hiperpotasemia. ¿Cuál es el fármaco sospechoso de causar la clínica y la alteración analítica de la paciente?
1. Hidroclorotiazida.
2. Bisoprolol.
3. Furosemida.
4. Enalapril.
5. Hidralazina.

Respuesta correcta: 4. Enalapril.